一位72歲男性，有反覆性之痔瘡脫垂（hemorrhoid prolapse），但拒絕接受手術治療，外科醫師遂轉介個案接受精神科心智狀態評估，以照會精神醫學的觀點，精神科醫師與病患會談的重點，不應該包含下列何者？
A. 評估病患或其家屬之術後照顧能力
B. 評估病患心智狀態對於手術之利弊與後遺症了解程度
C. 告知手術的必要性與成功率
D. 了解個案拒絕手術的原委

正確答案：C. 告知手術的必要性與成功率